腎臟鈍傷時，合併有腎血管傷害（Vascular injury）者，約佔多少百分比？
A. 50%
B. 35%
C. 15%
D. 1%

正確答案：D. 1%